Clinical trial exclusion criterion:
3. Evidence or history of left-sided heart disease and/or clinically significant cardiac disease in which pulmonary hypertension is more likely WHO Group 2.

Entity relations:
- Has_value("WHO Group", "2")
- Has_qualifier("cardiac disease", "clinically significant")
- AND("pulmonary hypertension", "WHO Group")
- Has_temporal("left-sided heart disease", "history")
- OR("left-sided heart disease", "cardiac disease", "pulmonary hypertension")